Pregnant or breastfeeding

The above is a clinical trial exclusion criterion. Annotated with entity spans:
[Observation: Pregnant] or [Observation: breastfeeding]